pregnancy or nursing mothers

The above is a clinical trial exclusion criterion. Annotated with entity spans:
[Condition: pregnancy] or [Condition: nursing] mothers